關於視覺皮質（visual cortex）的敘述，下列何者錯誤？
A. 視覺聯合皮質（visual association cortex）位於額葉（frontal lobe）
B. 初級視覺皮質（primary visual cortex）位於枕葉（occipital lobe）
C. 視覺聯合皮質（visual association cortex）可參與顏色判定與辨別
D. 初級視覺皮質（primary visual cortex）接受外側膝狀體（lateral geniculate body）傳入之訊息

正確答案：A. 視覺聯合皮質（visual association cortex）位於額葉（frontal lobe）